下列有關第二頸椎樞突骨折（odontoid process fracture）之敘述，何者錯誤？
A. 第一型骨折（Type I fracture）大都發生在翼狀韌帶（alar ligament）的接著處
B. 第二型骨折（Type II fracture）最常發生，但是較穩定
C. 第二型骨折發生在樞突（odontoid process）的基底部（base）不侵犯到第二頸椎椎體部（body）
D. 第三型骨折（Type III fracture）發生在樞突的基底部並侵犯到第二頸椎椎體部

正確答案：B. 第二型骨折（Type II fracture）最常發生，但是較穩定